What are the biological roles proposed for proteins containing the SPRY domain?

defence against retroviral infection
innate and adaptative immunity
vesicular trafficking
neural differentiation
embryonic development